健康的決定因子中，下列那一項最具影響力？
A. 生物遺傳
B. 醫療照護
C. 社經狀況
D. 環境與生活方式

正確答案：D. 環境與生活方式